Clinical trial inclusion criterion:
Anxiety Cohort: Meet DSM-5 criteria for any of the following anxiety disorders: Social Anxiety Disorders, Generalized Anxiety Disorder, Separation Anxiety Disorder and/or Panic Disorder by structured interview (MINI-KID); ADIS Clinical Severity Rating ≥4 (moderately severe) for any of the 4 included anxiety disorders; Failure to achieve remission with at least 1 adequate prior anxiolytic medication trial (e.g. SSRI, SNRI, or TCA), meaning at least 8 weeks at therapeutic dosing, including at least 4 weeks of stable dosing; Failure to achieve remission with previous CBT or subject declines current CBT therapy

Entity relations:
- Subsumes("structured interview", "MINI-KID")
- AND("Social Anxiety Disorders", "structured interview")
- Subsumes("anxiety disorders", "Social Anxiety Disorders")
- Has_value("ADIS Clinical Severity Rating", "≥4")
- Subsumes("ADIS Clinical Severity Rating", "moderately severe")
- multi("anxiolytic medication trial", "anxiolytic medication")
- Has_temporal("anxiolytic medication trial", "prior")
- Subsumes("anxiolytic medication trial", "SSRI")
- Has_qualifier("anxiolytic medication trial", "adequate")
- Has_multiplier("anxiolytic medication trial", "at least 1")
- Has_negation("remission", "Failure")
- Has_multiplier("stable dosing", "at least 4 weeks")
- Has_multiplier("therapeutic dosing", "at least 8 weeks")
- Has_temporal("CBT therapy", "previous")
- Has_negation("remission", "Failure")
- Has_temporal("CBT therapy", "current")
- AND("subject declines", "CBT therapy")
- AND("remission", "CBT therapy")
- AND("anxiolytic medication trial", "therapeutic dosing")
- AND("remission", "anxiolytic medication trial")
- Has_qualifier("anxiety disorders", "DSM-5 criteria")
- AND("anxiety disorders", "ADIS Clinical Severity Rating")
- AND("Anxiety Cohort", "anxiety disorders")
- AND("Anxiety Cohort", "anxiety disorders")
- AND("Anxiety Cohort", "remission")
- AND("Anxiety Cohort", "remission")
- OR("Social Anxiety Disorders", "Separation Anxiety Disorder", "Panic Disorder", "Generalized Anxiety Disorder")
- OR("SSRI", "TCA", "SNRI")
- OR("CBT therapy", "subject declines")